Joven de 24 años con hipogonadismo de origen hipotalámico secundario a craneofaringioma intervenido, en tratamiento sustitutivo con undecanoato de testoterona cada 12 semanas de forma intramuscular, que nos es remitido desde otro centro para seguimiento. El paciente nos interroga en la visita inicial acerca del seguimiento de su patología de base, posibles eventos adversos del tratamiento hormonal y probabilidades de tener descendencia en un futuro. ¿Cuál de las siguientes aseveraciones NO es correcta?
1. Las concentraciones de testosterona sérica deberían medirse justo antes de cada inyección subsiguiente.
2. El objetivo de tratamiento es mantener las concentraciones de testosterona sérica en rango medio de normalidad.
3. Está indicado revisar el hematocrito de forma anual.
4. El tratamiento con testosterona intramuscular de forma prolongada aumentará las probabilidades de concepción con su pareja.
5. El tratamiento con testosterona no requiere la monitorización de las concentraciones de hormona luteinizante.

Respuesta correcta: 4. El tratamiento con testosterona intramuscular de forma prolongada aumentará las probabilidades de concepción con su pareja.